What is the role of SDE2?

The role of SDE2 is to regulate RNA splicing and ribosome biogenesis.